4. Noise-induced hearing loss or tinnitus.

The above is a clinical trial exclusion criterion. Annotated with entity spans:
[Parsing_Error: 4.] [Condition: Noise-induced hearing loss] or [Condition: tinnitus].